Clinical trial inclusion criterion:
Patients should have been on non-steroidal anti-inflammatory drugs (NSAIDs) at the maximum tolerated dose for at least 4 weeks prior to their Baseline Visit, with an inadequate response or for less than 4 weeks if withdrawn for intolerance, toxicity or contraindications

Annotated entities:
- Drug: "non-steroidal anti-inflammatory drugs (NSAIDs)"
- Multiplier: "maximum tolerated dose"
- Temporal: "for at least 4 weeks prior to their Baseline Visit"
- Reference_point: "their Baseline Visit"
- Condition: "inadequate response"
- Temporal: "for less than 4 weeks"
- Condition: "withdrawn for intolerance"
- Condition: "withdrawn for toxicity"
- Condition: "contraindications"